Patients receiving injection to treatment knee within 2 months of study enrollment

The above is a clinical trial exclusion criterion. Annotated with entity spans:
Patients receiving [Procedure: injection] to treatment [Qualifier: knee] [Temporal: within 2 months of study enrollment]